85歲老太太身體一向硬朗，行動自如，女兒從美國回來，與老太太共眠。半夜，老太太醒來，問床邊人：妳是誰？同住家人表示，這幾個月來，老太太常常找不到物品放在何處。到菜市場買菜，常常買回來冰箱已堆 滿的相同食材。這位老太太最可能得了何種病？
A. Alzheimer disease
B. dementia with Lewy bodies
C. Parkinson disease with dementia
D. vascular dementia

正確答案：A. Alzheimer disease